Clinical trial exclusion criterion:
Intracranial pathology: tumor, arteriovenous fistula or aneurysm.

Annotated entities:
- Condition: "Intracranial pathology"
- Condition: "tumor"
- Condition: "arteriovenous fistula"
- Condition: "aneurysm"